What is another name for acid sphingomyelinase deficiency (ASMD)?

Acid sphingomyelinase deficiency(ASMD) is also known as Niemann-Pick disease type A and type B.